Clinical trial exclusion criterion:
Mixed phenotype acute leukemia (MPAL)

Entity relations:
- Subsumes("Mixed phenotype acute leukemia", "MPAL")